臨床上欲了解是否有胰臟外分泌（exocrine）功能不全，下列何者為目前最常用且最具可信度之方法？
A. 糞便常規檢查時以顯微鏡觀察脂肪球之存在與否
B. 收集 72 小時糞便脂肪內容物之含量占所攝取全部脂肪之百分比
C. 於十二指腸收集胰液，並定量其 trypsin 及 chymotrypsin 濃度
D. 測量糞便中 chymotrypsin 之量

正確答案：B. 收集 72 小時糞便脂肪內容物之含量占所攝取全部脂肪之百分比